Known renal failure or allergy to acetazolamide and other sulfonamides

The above is a clinical trial exclusion criterion. Annotated with entity spans:
Known [Condition: renal failure] or [Condition: allergy] to [Drug: acetazolamide] and other [Drug: sulfonamides]